En lo referente a los pirógenos y los medicamentos biotecnológicos es posible decir:
1. No tienen tendencia a agregarse ni formar unidades grandes con alto peso molecular.
2. Los procedimientos de cromatografía de intercambio iónico (usando su carga positiva) puede reducir los niveles de endotoxinas.
3. Los procedimientos de cromatografía de intercambio iónico (usando su carga negativa) puede reducir los niveles de endotoxinas.
4. Los procedimientos de cromatografía de intercambio iónico (con independencia de su carga) puede reducir los niveles de endotoxinas.
5. Son inestables en condiciones estándar de autoclavado.

Respuesta correcta: 3. Los procedimientos de cromatografía de intercambio iónico (usando su carga negativa) puede reducir los niveles de endotoxinas.